Treatment with psychotropic medications in the 2 weeks prior to randomization with the exception of approved treatments for dementia (ChEIs and memantine), selective serotonin reuptake inhibitor antidepressants, and trazodone (if used as an aid to facilitate sleep and not as an antidepressant); other psychotropics (with the exclusion of antipsychotics), if stable for 3 months, may be allowed only with Steering Committee approval on a case by case basis. Note that antipsychotics are expressly prohibited.

The above is a clinical trial exclusion criterion. Annotated with entity spans:
Treatment with [Drug: psychotropic medications] [Temporal: in the 2 weeks prior to randomization] [Negation: with the exception of] approved [Procedure: treatments for dementia] ([Drug: ChEIs] and [Drug: memantine]), [Drug: selective serotonin reuptake inhibitor antidepressants], and [Drug: trazodone] [Context_Error: (if used as an aid to facilitate sleep and not as an antidepressant)]; [Drug: other psychotropics] ([Negation: with the exclusion of] [Drug: antipsychotics]), if [Qualifier: stable] [Temporal: for 3 months], may be allowed only with Steering Committee approval on a case by case basis. Note that antipsychotics are expressly prohibited.